Clinical trial exclusion criterion:
peridevice leak >5mm on transesophageal echocardiography study preceding enrollment

Entity relations:
- Has_value("peridevice leak", ">5mm")
- AND("transesophageal echocardiography study", "peridevice leak")